Clinical trial exclusion criteria:
Untreated symptomatic brain or leptomeningeal metastatic disease.
Medical or psychiatric conditions comprising informed consent.
Any medical condition which in the opinion of the investigator would compromise the ability of the patient to participate in the trial or which would jeopardise compliance with the protocol.
Radiotherapy within 4 weeks of trial entry.
Active autoimmune disease that has required systemic treatment in past 2 years
Chronic usage of steroids or other immunosuppressant medication.
Previous history of pneumonitis.
Any evidence of clinical autoimmunity.

Annotated entities:
- Condition: "symptomatic brain metastatic disease"
- Condition: "symptomatic leptomeningeal metastatic disease"
- Qualifier: "Untreated"
- Condition: "psychiatric conditions"
- Undefined_semantics: "psychiatric conditions"
- Condition: "Medical conditions"
- Subjective_judgement: "Medical or psychiatric conditions comprising informed consent"
- Non-query-able: "Medical or psychiatric conditions comprising informed consent"
- Subjective_judgement: "Any medical condition which in the opinion of the investigator would compromise the ability of the patient to participate in the trial or which would jeopardise compliance with the protocol."
- Context_Error: "Any medical condition which in the opinion of the investigator would compromise the ability of the patient to participate in the trial or which would jeopardise compliance with the protocol."
- Procedure: "Radiotherapy"
- Temporal: "within 4 weeks of trial entry"
- Reference_point: "trial entry"
- Condition: "autoimmune disease"
- Temporal: "Active"
- Procedure: "systemic treatment"
- Temporal: "in past 2 years"
- Drug: "steroids"
- Multiplier: "Chronic usage"
- Drug: "immunosuppressant medication"
- Undefined_semantics: "immunosuppressant medication"
- Condition: "pneumonitis"
- Temporal: "history"
- Condition: "autoimmunity"
- Condition: "Any evidence of clinical autoimmunity"